Clinical trial exclusion criterion:
Poorly regulated diabetes (>200 mg/dl (=11 mmol/l))

Entity relations:
- Subsumes("Poorly regulated", ">200 mg/dl (=11 mmol/l)")
- Has_qualifier("diabetes", "Poorly regulated")